下列有關 GM-CSF（sargramostim）和 G-CSF（filgrastim）生長因子之敘述，何者錯誤？
A. GM-CSF 和 G-CSF 皆可增加 neutrophil 數目
B. 兩者均可增加末梢血液中 stem cells 數目
C. GM-CSF 可增加 eosinophil 數目
D. GM-CSF 產生之不良作用小於 G-CSF

正確答案：D. GM-CSF 產生之不良作用小於 G-CSF